Subjects planned to be implanted with the RELIANCE 4-FRONT Passive Fixation Lead

The above is a clinical trial inclusion criterion. Annotated with entity spans:
Subjects [Mood: planned] to be [Procedure: implanted with the RELIANCE 4-FRONT Passive Fixation Lead]